Queremos comparar las medias de dos poblaciones que siguen distribuciones normales y tienen la misma varianza. Tomamos dos muestras de tamaño n1 y n2. Al construir un intervalo de confianza tendremos que calcular un valor t para una distribución T de Student con:
1. 2 grados de libertad.
2. n1 + n2 – 2 grados de libertad.
3. (n1 + n2) – 1 grados de libertad.
4. (n1 x n2)/2 grados de libertad.
5. Grados de libertad calculados con la fórmula de Welch o Smith-Satterwhite.

Respuesta correcta: 2. n1 + n2 – 2 grados de libertad.